Los filtros HEPA se utilizan para la esterilización de:
1. Líquidos orgánicos.
2. Aire.
3. Caldo de cultivo.
4. Antibióticos.
5. Soluciones de azúcares.

Respuesta correcta: 2. Aire.